Clinical trial exclusion criterion:
Allergy to gonadotrophins

Annotated entities:
- Drug: "gonadotrophins"
- Condition: "Allergy"